Clinical trial exclusion criterion:
Other inflammatory Knee Osteoarthritis (e.g. gout, rheumatoid arthritis, etc.)

Annotated entities:
- Qualifier: "Other"
- Condition: "inflammatory Knee Osteoarthritis"
- Condition: "gout"
- Condition: "rheumatoid arthritis"